Clinical trial inclusion criterion:
No previous blood transfusion

Annotated entities:
- Negation: "No"
- Temporal: "previous"
- Procedure: "blood transfusion"